La gradación de un tumor se refiere a:
1. Determinar la extensión de la enfermedad considerando el tamaño del tumor y la diseminación.
2. Medir el crecimiento celular anormal respecto al tamaño, forma y disposición del tumor.
3. Obtener una muestra de tejido para analizarlo al microscopio y detectar células malignas.
4. Identificar el tipo de tejido que originó el tumor y el grado en que las células tumorales conservan las características del tejido de origen.
5. Seleccionar terapéuticas específicas para destruir las células tumorales mediante la interferencia de sus funciones celulares.

Respuesta correcta: 4. Identificar el tipo de tejido que originó el tumor y el grado en que las células tumorales conservan las características del tejido de origen.